Clinical trial exclusion criterion:
Ongoing cord compression or a syrinx in the spinal cord or who suffer from a spinal cord disease such as spinal stenosis, spina bifida or herniated cervical disk.

Annotated entities:
- Condition: "cord compression"
- Condition: "syrinx"
- Qualifier: "spinal cord"
- Condition: "spinal cord disease"
- Condition: "spinal stenosis"
- Condition: "spina bifida"
- Condition: "herniated cervical disk"